Clinical trial exclusion criterion:
Hospitalization for myocardial infarction or cardiac surgery within previous 90 days

Entity relations:
- AND("Hospitalization", "myocardial infarction")
- Has_temporal("myocardial infarction", "within previous 90 days")
- OR("myocardial infarction", "cardiac surgery")